Which was the first cholera vaccine approved in the US?

Vaxchora is the first vaccine approved by the Food and Drug Administration for the prophylaxis of cholera infection.